Clinical trial exclusion criterion:
Patients in paliative care

Annotated entities:
- Context_Error: "Patients in paliative care"